Ability to comply with completion of electronic diary.

The above is a clinical trial inclusion criterion. Annotated with entity spans:
[Post-eligibility: Ability to comply with completion of electronic diary.]